En una electrólisis:
1. Se fuerza a que tenga lugar una reacción en la dirección que no es espontánea.
2. Se desprende siempre hidrógeno en el cátodo.
3. Se desprende siempre oxígeno en el ánodo.
4. La reacción electroquímica es espontánea.

Respuesta correcta: 1. Se fuerza a que tenga lugar una reacción en la dirección que no es espontánea.